Which histone mark is recognized by HP1?

HP1 can bind with high affinity to histone H3 methylated at lysine 9 but not at lysine 4. Methylation of lysine 9 in histone H3 is recognized by heterochromatin protein 1 (HP1), which directs the binding of other proteins to control chromatin structure and gene expression.